一位 41 歲男性工人在高架橋上施工時，失足從高架橋上掉下來。理學檢查發現病人意識清楚，生命徵象穩定，但尿道口有血跡，而且陰囊有血腫，會陰有瘀青。接下來你應安排何種檢查？
A. intravenous pyelography
B. contrast-enhanced computed tomography
C. retrograde urethrography
D. cystography

正確答案：C. retrograde urethrography